Clinical trial exclusion criterion:
Endocrine disease:

Annotated entities:
- Condition: "Endocrine disease"
- Non-representable: "Endocrine disease:"